Clinical trial exclusion criterion:
uncontrolled hypertension (> 180/100 mmHg)

Annotated entities:
- Condition: "uncontrolled hypertension"
- Value: "> 180/100 mmHg"